El denominado “efecto de mera exposición” señala que la exposición reiterada a un objeto social promueve hacia ese objeto:
1. Una mayor disonancia.
2. Un procesamiento cognitivo más complejo.
3. Una mayor atracción.
4. Una menor disonancia.
5. Una menor atracción.

Respuesta correcta: 3. Una mayor atracción.